Clinical trial inclusion criterion:
have the ability to follow multi-step commands.

Annotated entities:
- Condition: "ability to follow multi-step commands"